Clinical trial exclusion criterion:
Intends to donate eggs (female participants) or sperm (male participants) while receiving trial medication or within 6 months after trial medication

Entity relations:
- Has_index("while receiving trial medication", "trial medication")
- Has_index("within 6 months after trial medication", "trial medication")
- AND("female", "donate eggs")
- AND("male", "donate sperm")
- Has_temporal("female", "while receiving trial medication")
- OR("while receiving trial medication", "within 6 months after trial medication")
- OR("female", "male")